Clinical trial exclusion criterion:
benign prostatic hyperplasia

Annotated entities:
- Condition: "benign prostatic hyperplasia"